Respecto de las telomerasas ¿cuál de las siguientes afirmaciones no es cierta?:
1. Tienen actividad transcriptasa inversa.
2. Previenen el acortamiento de los telómeros.
3. Su defecto promueve la carcinogénesis.
4. Su actividad es esencial para la estabilidad de los cromosomas.
5. Son ribozimas.

Respuesta correcta: 3. Su defecto promueve la carcinogénesis.